Clinical trial inclusion criterion:
Women seeking medication abortion through 70 days gestation

Entity relations:
- Has_temporal("medication abortion", "through 70 days gestation")